一位本身罹患氣喘的媽媽，帶著她 10 個月大的兒子來到門診，詢問她的兒子以後是否會發生氣喘，她的兒子曾在 6 個月大時有一次喘鳴發作（wheezing episode）。下列敘述何者正確？
A. 若這位小朋友身上同時有濕疹（eczema），則他以後發生氣喘的機會較高
B. 若他的媽媽不喝酒，則他發展成氣喘的機會較小
C. 若他從小喝羊奶，則他發展成氣喘的機會較小
D. 長期使用氣管擴張劑，可以減少他以後發展成氣喘的機會

正確答案：A. 若這位小朋友身上同時有濕疹（eczema），則他以後發生氣喘的機會較高